Indique cuál de las siguientes vitaminas no es liposuble:
1. Vitamina E.
2. Vitamina D.
3. Vitamina K.
4. Vitamina B.
5. Vitamina A.

Respuesta correcta: 4. Vitamina B.